下列何者為抗癌化學藥物cisplatin之副作用？
A. 血鈣過高症
B. 血鎂過低症
C. 血鈉過低症
D. 血氯過高症

正確答案：B. 血鎂過低症